Clinical trial exclusion criterion:
Severe hepatitis activity as documented by ALT>10 x ULN

Annotated entities:
- Condition: "hepatitis"
- Qualifier: "Severe"
- Measurement: "ALT"
- Value: ">10 x ULN"